Ongoing ocular infection or inflammation in either eye.

The above is a clinical trial exclusion criterion. Annotated with entity spans:
[Temporal: Ongoing] [Condition: ocular infection] or inflammation [Qualifier: in either eye].